Clinical trial exclusion criterion:
Active or past psychotic disorder, including a history of psychotic affective state

Annotated entities:
- Condition: "psychotic disorder"
- Condition: "psychotic affective state"
- Temporal: "Active"
- Temporal: "past"